下列何種檢查結果代表病人可能有腎前性氮血症（prerenal azotemia）？
A. blood urea nitrogen /plasma creatinine（BUN/PCr）ratio< 10:1
B. urine sodium（UNa）>40 meq/L
C. urine osmolality <350 mOsmol/kg H2O
D. urine creatinine/plasma creatinine（UCr/PCr）>40

正確答案：D. urine creatinine/plasma creatinine（UCr/PCr）>40